Clinical trial inclusion criterion:
Elevated eye pressure

Annotated entities:
- Condition: "Elevated eye pressure"